Clinical trial inclusion criterion:
Creatinine <_1.6 mg/dl or creatinine clearance >_60 cc/min.

Entity relations:
- Has_value("creatinine clearance", ">_60 cc/min")
- Has_value("Creatinine", "<_1.6 mg/dl")
- OR("Creatinine", "creatinine clearance")